有關兒童社區性細菌性肺炎之併發症，下列何者最不常見？
A. 腦膜炎（Meningitis）
B. 心包膜炎（Pericarditis）
C. 膿胸（Empyema）
D. 肋膜積水（Pleural effusion）

正確答案：A. 腦膜炎（Meningitis）